Clinical trial inclusion criterion:
Positive anti-dsDNA.

Entity relations:
- Has_value("anti-dsDNA", "Positive")